Para el cribado de defectos del tubo neural durante el segundo trimestre del embarazo debe realizarse la determinación del siguiente marcador:
1. Beta2-microgobulina.
2. Prolactina.
3. Ferritina.
4. Alfa-fetoproteína.

Respuesta correcta: 4. Alfa-fetoproteína.